additional acupuncture

The above is a clinical trial exclusion criterion. Annotated with entity spans:
additional [Procedure: acupuncture]